Clinical trial inclusion criterion:
>5 pack-year history of smoking

Annotated entities:
- Measurement: "pack-year"
- Value: ">5"
- Observation: "smoking"